persistent pain for other reason

The above is a clinical trial exclusion criterion. Annotated with entity spans:
[Condition: persistent pain] for [Qualifier: other reason]